籃球場上，王喬登一個箭步右手持球上籃，可惜被李麥可狠狠蓋了一記大火鍋，喬登的右上臂被用力往後下壓下，只聽得他慘叫一聲，右臂就像"死鹹魚＂掛在身上，再也舉不起來。請問王喬登最可能發生的運動傷害為何？
A. 肩峰鎖骨關節脫位
B. 旋轉肌斷裂
C. 鎖骨非位移性（Non-displaced）骨折
D. 右肩關節前位脫臼合併關節盂唇瓣破裂

正確答案：D. 右肩關節前位脫臼合併關節盂唇瓣破裂